What percentage of Homo sapiens DNA is of Neanderthal origin?

3.6 % of the neanderthal genome is shared with roughly 65.4 % of the average european gene pool , which clinally diminishes with distance from europe.This work suggests that differences in effective population size may play a far more important role in shaping levels of introgression than previously thought.